三餐正常的人在午餐未進食前，下列那一項是血糖的主要來源？
A. 蛋白質
B. 肝臟中的肝醣（glycogen）
C. 肌肉中的肝醣
D. 脂肪組織的葡萄糖（glucose）

正確答案：B. 肝臟中的肝醣（glycogen）